Subjects were not to use any over-the-counter medication within 7 days prior to or during the study.

The above is a clinical trial exclusion criterion. Annotated with entity spans:
Subjects were [Negation: not] to use any [Drug: over-the-counter medication] [Temporal: within 7 days prior to] or [Temporal: during the study].